Clinical trial inclusion criterion:
Women of childbearing potential must agree to abstain from sexual relations that could result in pregnancy or use an effective method of birth control acceptable to both participant and the clinician prescriber during the study. Men are not required to use contraception during the study.

Annotated entities:
- Pregnancy_considerations: "Women of childbearing potential must agree to abstain from sexual relations that could result in pregnancy or use an effective method of birth control acceptable to both participant and the clinician prescriber during the study. Men are not required to use contraception during the study."